hearing is better than 30 deciBel (dB) in pure tone average (500, 1000, 2000, 3-4000 Hz) and speech discrimination better than 70%

The above is a clinical trial exclusion criterion. Annotated with entity spans:
[Measurement: hearing] is [Value: better than 30 deciBel (dB)] in [Qualifier: pure tone average] ([Qualifier: 500, 1000, 2000, 3-4000 Hz]) and [Measurement: speech discrimination] [Value: better than 70%]